Clinical trial exclusion criterion:
Has been diagnosed with cancer and who will be undergoing chemotherapy or radiation therapy during the vaccination healing time.

Entity relations:
- Has_index("during the vaccination healing time", "vaccination healing time")
- Has_temporal("chemotherapy", "during the vaccination healing time")
- OR("chemotherapy", "radiation therapy")